Clinical trial exclusion criterion:
insulin-dependent DM (diabetes mellitus), poorly controlled type II DM

Entity relations:
- Has_qualifier("type II DM", "poorly controlled")
- Subsumes("insulin-dependent DM", "diabetes mellitus")